Clinical trial inclusion criterion:
Patients had an inadequate response to, or had failed to tolerate, 1 or more of the following conventional therapies: oral 5-aminosalicylates, oral corticosteroids, azathioprine (AZA), and/or 6-mercaptopurine (6MP); or corticosteroid dependent (ie, an inability to taper corticosteroids without recurrence of UC symptoms).

Entity relations:
- AND("dependent", "corticosteroid")
- Has_multiplier("oral 5-aminosalicylates", "1 or more")
- AND("inadequate response", "oral 5-aminosalicylates")
- OR("inadequate response", "failed to tolerate")
- OR("oral 5-aminosalicylates", "6-mercaptopurine (6MP)", "oral corticosteroids", "azathioprine (AZA)")
- OR("inadequate response", "dependent")